羅醫師要為 58 歲的李先生進行胃癌切除手術，在上麻醉前麻醉科張醫師猛然發現胸部 X 光片上左肺下方隱約有兩個約 0.5 公分的病灶，無法確認是否為肺部轉移。張醫師忍不住喃喃自語：「唉！肺部已有轉移，還能開嗎？」躺在一旁仍然清醒的李先生立即回應：「什麼？羅醫師說可以開刀的，你是說他誤診了嗎？」這一情景張醫師顯然在言語上有些疏失，張醫師除了坦承失言並道歉外，下列何者為張醫師對自己失言給李先生最合宜的解釋？
A. 此異常發現會立即與羅醫師討論並確認開刀的適當性
B. 自己經常口無遮攔說了不該說的話
C. 羅醫師應該已經確認沒有肺部轉移
D. 麻醉科醫師並沒有表達意見的立場

正確答案：A. 此異常發現會立即與羅醫師討論並確認開刀的適當性